Undergone surgery within 3 days prior to the first day of dosing.

The above is a clinical trial exclusion criterion. Annotated with entity spans:
Undergone [Procedure: surgery] [Temporal: within 3 days prior to the first day of dosing].